Clinical trial exclusion criteria:
Participants taking CPI combination therapies with chemotherapy are not permitted.
Pregnant, lactating, or intending to become pregnant during the study.

Annotated entities:
- Procedure: "CPI combination therapies"
- Procedure: "chemotherapy"
- Condition: "Pregnant"
- Condition: "lactating"
- Mood: "intending to become"
- Condition: "pregnant"
- Temporal: "during the study"